Life expectancy less than 3 months

The above is a clinical trial exclusion criterion. Annotated with entity spans:
[Observation: Life expectancy] [Value: less than 3 months]